Have symptoms of both stress and urgency urinary incontinence

The above is a clinical trial inclusion criterion. Annotated with entity spans:
Have symptoms of both [Condition: stress] and [Condition: urgency urinary incontinence]